中腦的神經核中，含多巴胺（dopamine）神經元者為：
A. 紅核（red nucleus）
B. 黑質緻密部（substantia nigra, pars compacta）
C. 後縫核（posterior raphe nucleus）
D. 上丘（superior colliculus）

正確答案：B. 黑質緻密部（substantia nigra, pars compacta）